Indique cuál de los siguientes fármacos se utiliza como antídoto en la intoxicación con paracetamol:
1. N-acetilcisteína (NAC).
2. Desferroxamina.
3. Atropina.
4. Ibuprofeno.

Respuesta correcta: 1. N-acetilcisteína (NAC).